A free consent

The above is a clinical trial inclusion criterion. Annotated with entity spans:
[Informed_consent: A free consent]